Renal dysfunction defined as serum creatinine >2.0mg/dL

The above is a clinical trial exclusion criterion. Annotated with entity spans:
[Condition: Renal dysfunction] defined as [Measurement: serum creatinine] [Value: >2.0mg/dL]